Clinical trial inclusion criterion:
Total RLS severity score of 15 or greater on the IRLS rating scale at Visit 1 (screening) and at Visit 2 (baseline) (Appendix 8).

Annotated entities:
- Measurement: "Total RLS severity score"
- Value: "15 or greater"